Clinical trial inclusion criterion:
Measurable disease.

Annotated entities:
- Condition: "Measurable disease"